下列何者最常用來做為心肌氧氣需求之指標？
A. 心跳與收縮壓之乘積
B. 心跳與心搏量之乘積
C. 心跳與最大攝氧量之乘積
D. 心跳與心輸出量之乘積

正確答案：A. 心跳與收縮壓之乘積